Age range: 14 to 65 years-old;

The above is a clinical trial inclusion criterion. Annotated with entity spans:
[Person: Age] range: [Value: 14 to 65 years-old];